What are the generic versions of Viagra

Sildenafil Citrate and Elonza in Thailand are the generic versions of Viagra